Clinical trial exclusion criteria:
Suspected or known gynecological malignancy.
uterine size >12 weeks.
Endometriosis
Presence of adnexal mass.
cervix flushed with the vagina.
presence of significant scarring in the pelvic area from previous surgery.

Annotated entities:
- Condition: "gynecological malignancy"
- Mood: "Suspected"
- Mood: "known"
- Measurement: "uterine size"
- Value: ">12 weeks"
- Condition: "Endometriosis"
- Condition: "adnexal mass"
- Condition: "cervix flushed with the vagina"
- Condition: "significant scarring"
- Qualifier: "pelvic area"
- Procedure: "surgery"
- Qualifier: "from previous surgery"
- Temporal: "previous"